rheumatoid arthritis

The above is a clinical trial exclusion criterion. Annotated with entity spans:
[Condition: rheumatoid arthritis]